Clinical trial exclusion criterion:
Non papillary gross features of the tumor

Annotated entities:
- Condition: "Non papillary gross features"
- Condition: "tumor"